Hydrocephalus with ventricular drain

The above is a clinical trial exclusion criterion. Annotated with entity spans:
[Condition: Hydrocephalus] with [Device: ventricular drain]